Clinical trial inclusion criterion:
Pulmonary oedema

Annotated entities:
- Condition: "Pulmonary oedema"